Clinical trial exclusion criterion:
History of malignancy, except basal skin cell carcinoma

Annotated entities:
- Condition: "malignancy"
- Negation: "except"
- Condition: "basal skin cell carcinoma"